Clinical trial exclusion criterion:
6. Current malignancy or history of a prior malignancy

Entity relations:
- Has_temporal("malignancy", "history of a prior")
- Has_temporal("malignancy", "Current")
- OR("malignancy", "malignancy")